¿Cuál es la complicación evolutiva más frecuente en las meningitis bacterianas en la edad pediátrica?
1. Hipoacusia.
2. Epilepsia residual.
3. Retraso mental.
4. Hidrocefalia.
5. Defectos visuales.

Respuesta correcta: 1. Hipoacusia.